Presence of severe systemic disease

The above is a clinical trial exclusion criterion. Annotated with entity spans:
Presence of [Qualifier: severe] [Condition: systemic disease]